關於背側脊髓小腦徑（dorsal spinocerebellar tract）之敘述，下列何者錯誤？
A. 背側脊髓小腦徑主要經由下小腦腳（inferior cerebellar peduncle）進入小腦
B. 可將訊息傳入脊髓小腦（spinocerebellum）
C. 背側脊髓小腦徑位於脊髓（spinal cord）之背側束（dorsal funiculus）
D. 背側脊髓小腦徑主要將訊息傳入同側小腦

正確答案：C. 背側脊髓小腦徑位於脊髓（spinal cord）之背側束（dorsal funiculus）